一位50歲女性有狹心症病史數年，最近因為疲倦無力，食慾減少，身體檢查發現皮膚有白斑 （vitiligo）；實	室檢查free T4 0.5 ng/dL（normal range 0.8～1.8 ng/dL），TSH 25 µIU/mL（normal range 0.1～2.0 µIU/mL），early morning cortisol 1.0 µg/dL（normal range 9.0～15 µg/dL）。其母親有Graves' disease病史，妹妹有Hashimoto's thyroiditis病史。最好的治療方式為何？
A. 先給予甲狀腺素每天100 µg，再給予可體酮（cortisone）每天25 mg
B. 先給予可體酮每天25 mg，再給予甲狀腺素每天100 µg
C. 先給予甲狀腺素每天25 µg，再給予可體酮每天25 mg
D. 先給予可體酮每天25 mg，再給予甲狀腺素每天25 µg

正確答案：D. 先給予可體酮每天25 mg，再給予甲狀腺素每天25 µg